Clinical trial exclusion criterion:
Significant renal dysfunction (see also exclusion criteria laboratory abnormalities).

Entity relations:
- Has_qualifier("renal dysfunction", "Significant")